下列何者最可能增加心肌細胞的收縮力（contractility）？
A. 促進肌漿網（sarcoplasmic reticulum）上的鈣離子幫浦（Ca2+ ATPase）的活性
B. 抑制肌漿網（sarcoplasmic reticulum）上ryanodine receptors的作用
C. 抑制細胞膜上鈉－鉀幫浦（Na+-K+ ATPase）的作用
D. 增加細胞膜上鈉－鈣交換蛋白（Na+-Ca2+ exchanger）的活性

正確答案：C. 抑制細胞膜上鈉－鉀幫浦（Na+-K+ ATPase）的作用